Clinical trial exclusion criterion:
Tetrabenazine

Annotated entities:
- Drug: "Tetrabenazine"